Platelet count < 105/mm3;

The above is a clinical trial exclusion criterion. Annotated with entity spans:
[Measurement: Platelet count] [Value: < 105/mm3];